Clinical trial exclusion criterion:
Unable to weight

Entity relations:
- AND("Unable", "weight")